Clinical trial exclusion criterion:
Neuropathy, grade 2 or greater by NCI-CTCAE, v 4.0

Annotated entities:
- Condition: "Neuropathy"
- Measurement: "NCI-CTCAE, v 4.0"
- Value: "grade 2 or greater"